腮腺切除時為了保留顏面神經，須將腮腺之深、淺葉分開，常和腮腺分泌管（parotid duct）併行的顏面神經分支是：
A. 頸支（Cervical branch）
B. 下頜緣支（Marginal mandibular branch）
C. 頰支（Buccal branch）
D. 顴支（Zygomatic branch）

正確答案：C. 頰支（Buccal branch）